關於神經肌肉突觸疾病之敘述，下列何者錯誤？
A. 肉毒桿菌素中毒為神經肌肉突觸前障礙疾病
B. 重症肌無力症為神經肌肉突觸後障礙疾病
C. 呼吸困難常是肉毒桿菌素中毒致命的主因
D. 心肌侵犯常是重症肌無力症致命的主因

正確答案：D. 心肌侵犯常是重症肌無力症致命的主因